Clinical trial exclusion criteria:
contraindications from manufacturer for medications including currently taking haloperidol, artane, Phenergan (Promethazine), chlorpromazine, erythromycin, Azithromycin, clarithromycin, Ketoconazole, fluconazole, mefloquine (as prophylaxis), lumefantrine (in Coartem), quinine, Septrin
anyone seriously ill
currently taking antimalarial medicines
allergy to artemisinin drugs
pregnant women in first trimester
children under 3 months of age
reported heart condition

Annotated entities:
- Condition: "contraindications"
- Drug: "haloperidol"
- Drug: "Phenergan"
- Drug: "Promethazine"
- Drug: "artane"
- Drug: "chlorpromazine"
- Drug: "erythromycin"
- Drug: "Azithromycin"
- Drug: "clarithromycin"
- Drug: "Ketoconazole"
- Drug: "fluconazole"
- Drug: "mefloquine"
- Drug: "lumefantrine"
- Drug: "Coartem"
- Drug: "quinine"
- Drug: "Septrin"
- Condition: "seriously ill"
- Drug: "antimalarial medicines"
- Drug: "artemisinin drugs"
- Condition: "allergy"
- Condition: "pregnant"
- Person: "women"
- Condition: "first trimester"
- Qualifier: "first trimester"
- Person: "children"
- Value: "under 3 months"
- Person: "age"
- Condition: "heart condition"